Clinical trial inclusion criterion:
Histopathologic confirmed squamous cell carcinoma of head and neck ,including oral cavity, oropharynx, larynx, or hypopharynx.

Entity relations:
- Has_qualifier("squamous cell carcinoma", "Histopathologic confirmed")
- Has_qualifier("squamous cell carcinoma", "head and neck")
- Subsumes("head and neck", "oral cavity")
- OR("oral cavity", "oropharynx", "larynx", "hypopharynx")